Clinical trial inclusion criterion:
Platelet count of 100,000/mm3 or greater

Entity relations:
- Has_value("Platelet count", "100,000/mm3 or greater")